Erenumab, used to treat migraine headaches, binds to what protein?

Erenumab binds to the CGRP receptor to treat migraine headaches